Clinical trial exclusion criterion:
SBP=180mmHg, or DBP=110mmHg;

Entity relations:
- Has_value("SBP", "=180mmHg")
- Has_value("DBP", "=110mmHg")
- OR("SBP", "DBP")